Clinical trial exclusion criterion:
Pregnancy or nursing.

Annotated entities:
- Condition: "Pregnancy"
- Condition: "nursing"